Patients must have received prior external beam radiation therapy to the region proposed for HDR brachytherapy treatment; evaluation of doses previously delivered to spinal cord/cauda equine, pelvis, and other critical structures (bowel, kidneys, rectum) will be taken into consideration.

The above is a clinical trial inclusion criterion. Annotated with entity spans:
Patients must have received [Temporal: prior] [Procedure: external beam radiation therapy] [Qualifier: to the region proposed for HDR brachytherapy treatment]; [Not_a_criteria: evaluation of doses previously delivered to spinal cord/cauda equine, pelvis, and other critical structures (bowel, kidneys, rectum) will be taken into consideration.]